關於胎兒性器官的分化之敘述，下列何者錯誤？
A. 要有Y染色體並且有SRY基因，胎兒性器官才會發育成睪丸、輸精管、儲精囊與陰莖
B. Sertoli細胞會製造及分泌AMH（antimüllerian hormone）
C. AMH會抑制Wolffian管的分化與生長
D. Leydig細胞會製造及分泌testosterone

正確答案：C. AMH會抑制Wolffian管的分化與生長